Clinical trial exclusion criterion:
Contraindication to Aspirin

Entity relations:
- AND("Contraindication", "Aspirin")